Clinical trial exclusion criterion:
Known positive status for HIV, active hepatitis B or hepatitis C

Annotated entities:
- Condition: "HIV"
- Condition: "hepatitis B"
- Condition: "hepatitis C"
- Temporal: "active"